History or known presence of central nervous system metastases.

The above is a clinical trial exclusion criterion. Annotated with entity spans:
History or known presence of [Condition: central nervous system metastases].